Patients using oral contraception.

The above is a clinical trial exclusion criterion. Annotated with entity spans:
Patients using [Procedure: oral contraception].